Understands and signs the informed consent form.

The above is a clinical trial inclusion criterion. Annotated with entity spans:
[Informed_consent: Understands and signs the informed consent form.]